Clinical trial inclusion criterion:
ASA I, II, III.

Entity relations:
- Has_value("ASA", "I, II, III")